Clinical trial exclusion criterion:
Concurrent use of organic nitrites and nitrates.

Entity relations:
- Has_temporal("organic nitrites", "Concurrent")
- Has_temporal("nitrates", "Concurrent")